Clinical trial inclusion criterion:
The participant has a diagnosis of Parkinson's disease according to the diagnostic criteria of the UK Parkinson's Disease Society Brain Bank.

Entity relations:
- AND("Parkinson's disease", "UK Parkinson's Disease Society Brain Bank")